Clinical trial inclusion criterion:
Have a good clinical response to TB.

Annotated entities:
- Condition: "good clinical response"
- Condition: "TB"